AST or ALT > 120

The above is a clinical trial exclusion criterion. Annotated with entity spans:
[Measurement: AST] or [Measurement: ALT] [Value: > 120]